有關陰莖勃起時之生理敘述，下列何者正確？
A. 屬交感神經興奮所引起
B. 陰莖內之神經末梢會分泌一氧化氮（Nitric oxide）
C. 陰莖海綿體（Corpus cavernosa）之平滑肌呈收縮狀態
D. 海綿體內的動脈呈收縮狀態

正確答案：B. 陰莖內之神經末梢會分泌一氧化氮（Nitric oxide）